下列何構造衍生成陰囊？
A. 生殖結節（genital tubercle）
B. 生殖隆起（genital swelling）
C. 肛門褶（anal fold）
D. 尿道褶（urethral fold）

正確答案：B. 生殖隆起（genital swelling）